一位 28 歲婦女連續經歷 3 次懷孕中期（14~20 週）之自然流產，3 次流產在急診時都發現子宮頸幾乎全開，羊膜袋（water bag）膨出至陰道之中，但無明顯子宮收縮現象。現在是她第 4 次懷孕之第 週，下列何者是最適當之處置？
A. 補充雌激素
B. 補充黃體素
C. 實施子宮頸環匝術（cervical cerclage）
D. 使用預防性安胎藥（例如鈣離子阻斷劑（calcium channel blocker））

正確答案：C. 實施子宮頸環匝術（cervical cerclage）